Patients affected by metabolic or thyroid disorders;

The above is a clinical trial exclusion criterion. Annotated with entity spans:
Patients affected by [Condition: metabolic] or [Condition: thyroid disorders];